下列診斷標誌，何者可以最早偵測急性人類免疫不全病毒（HIV）感染？
A. p24 antigen
B. HIV viral load
C. HIV antibody
D. Western blot

正確答案：B. HIV viral load